在糖解作用（glycolysis）中，下列那個酵素所催化的反應中，可直接生成 ATP？
A. 磷酸甘油酸變位酶（phosphoglycerate mutase）
B. 磷酸甘油酸激酶（phosphoglycerate kinase）
C. 烯醇化酶（enolase）
D. 磷酸果糖激酶（phosphofructokinase）

正確答案：B. 磷酸甘油酸激酶（phosphoglycerate kinase）